Severe asthma exacerbation requiring resuscitation

The above is a clinical trial exclusion criterion. Annotated with entity spans:
[Qualifier: Severe] [Condition: asthma exacerbation] requiring [Procedure: resuscitation]